Dialysis for acute renal failure within the 6 previous months.

The above is a clinical trial exclusion criterion. Annotated with entity spans:
[Procedure: Dialysis] for [Condition: acute renal failure] [Temporal: within the 6 previous months].